Clinical trial inclusion criteria:
weigh more than 200 lbs
are high level ambulators corresponding to levels E to F of the Special Interest Group of Amputee Medicine (SIGAM) mobility grade
have the ability to follow multi-step commands.

Annotated entities:
- Measurement: "weigh"
- Value: "more than 200 lbs"
- Condition: "high level ambulators"
- Measurement: "Special Interest Group of Amputee Medicine (SIGAM) mobility grade"
- Value: "levels E to F"
- Condition: "ability to follow multi-step commands"